Clinical trial exclusion criterion:
Subject has sarcoidosis.

Annotated entities:
- Condition: "sarcoidosis"